Kelly diseño un procedimiento complejo en el que el cliente escribe una descripción de sí mismo (autocaracterización) y luego el terapeuta la re-escribe de forma que permita la exploración de otros esquemas alternativos. Se pide entonces al sujeto que ejecute el nuevo rol en su vida cotidiana durante dos semanas con la debida preparación y entrenamiento. Acabado este intenso periodo la nueva perspectiva adquirida permite que el cliente, con la ayuda del terapeuta, reestructure algunos de sus viejos esquemas supraordenados ¿Cómo se llama este procedimiento?:
1. Búsqueda de alternativas.
2. Técnica de re-atribución.
3. Análisis de costes y beneficios.
4. Técnica de rol fijo.

Respuesta correcta: 4. Técnica de rol fijo.